下列何者因可抑制calcineurin phosphatase，可減少器官移植後的排斥反應？
A. basilixmab
B. methylprednisolone
C. cyclosporine
D. orthoclone OKT3

正確答案：C. cyclosporine